No contraindication to CTA

The above is a clinical trial inclusion criterion. Annotated with entity spans:
[Negation: No] [Condition: contraindication] to [Procedure: CTA]